Clinical trial exclusion criterion:
Intranasal steroid use within the last three months

Annotated entities:
- Procedure: "Intranasal steroid use"
- Temporal: "within the last three months"
- Qualifier: "Intranasal"
- Drug: "steroid"